Clinical trial inclusion criterion:
Meet DSM-IV criteria for BPD as assessed by the Structured Clinical Interview for DSM-IV Personality Disorders (SCID-II).

Entity relations:
- Has_qualifier("BPD", "Meet DSM-IV criteria")
- AND("Structured Clinical Interview for DSM-IV Personality Disorders (SCID-II)", "BPD")